觸電或被閃電擊中的急救處理原則，下列敘述何者錯誤？
A. 觸電或被閃電擊中造成心臟停止，救回來以後都要給大量水分，以防腎衰竭
B. 被閃電擊中若造成大量傷患，此時應採反向的檢傷分類（reverse triage）
C. 無論是觸電或被閃電擊中造成心臟停止，在回復自發性循環前，其急救方法與一般心臟停止相同
D. 去急救觸電的病人，首要任務是確保自身安全

正確答案：A. 觸電或被閃電擊中造成心臟停止，救回來以後都要給大量水分，以防腎衰竭